Clinical trial exclusion criterion:
Patients with a calculated PRA higher than 0% per solid phase and / or anti-HLA class I and / or class II antibodies detectable by single antigen test (Luminex®).

Entity relations:
- Has_value("single antigen test", "anti-HLA class I")
- Subsumes("single antigen test", "Luminex")
- OR("anti-HLA class I", "anti-HLA class II")